臨床上在決定採取何種眼瞼下垂矯治手術的方法時，下列那一個因素為最重要考量？
A. 性別
B. 年齡
C. 單側或雙側眼瞼下垂
D. 上眼瞼提肌（levator）之功能

正確答案：D. 上眼瞼提肌（levator）之功能